下列何者不是造成延遲性黃疸之原因？
A. 膽道阻塞
B. 配方奶哺育
C. 泌尿道感染
D. 甲狀腺低下症

正確答案：B. 配方奶哺育